Dementia or otherwise impaired cognition

The above is a clinical trial exclusion criterion. Annotated with entity spans:
[Condition: Dementia] or otherwise [Condition: impaired cognition]